Clinical trial inclusion criterion:
Baseline anemia

Entity relations:
- Has_temporal("anemia", "Baseline")